Clinical trial inclusion criterion:
weight </= 100kg

Annotated entities:
- Measurement: "weight"
- Value: "</= 100kg"